根據 1982 年美國風濕病學院所制定的全身性紅斑狼瘡（SLE）的 11 項分類準則中符合 4 項即可診斷。 下列何種組合最符合 SLE 的診斷？
A. 臉頰部紅斑，發燒，關節疼痛及口腔黏膜潰瘍
B. 抗核抗體陽性，抗 dsDNA 抗體升高，尿蛋白 1.25 公克/天，以及血小板數為 68,000/μL
C. 多發性關節炎，抗核抗體陽性，白血球增加及肋膜炎
D. 多發性關節痛，口腔黏膜潰瘍，抽搐及血清補體 C3 降低

正確答案：B. 抗核抗體陽性，抗 dsDNA 抗體升高，尿蛋白 1.25 公克/天，以及血小板數為 68,000/μL